Clinical trial exclusion criterion:
uncontrolled hypertension,

Annotated entities:
- Condition: "hypertension"
- Qualifier: "uncontrolled"